Clinical trial exclusion criteria:
Severe co-morbid illness such as untreatable other malignancy and/or active infections.
Pregnant or lactating women
Hypersensitivity to Sandostatin or any component of the formulation.

Annotated entities:
- Condition: "co-morbid illness"
- Qualifier: "Severe"
- Qualifier: "untreatable"
- Qualifier: "other"
- Condition: "malignancy"
- Qualifier: "active"
- Condition: "infections"
- Condition: "Pregnant"
- Condition: "lactating"
- Person: "women"
- Condition: "Hypersensitivity"
- Drug: "Sandostatin"
- Drug: "component of the formulation"